Clinical trial inclusion criterion:
R0, R1 resection

Annotated entities:
- Procedure: "R1 resection"
- Procedure: "R0 resection"